Clinical trial exclusion criterion:
Pinhole visual acuity worse than 20/200 in the unaffected eye

Entity relations:
- Has_value("Pinhole visual acuity", "worse than 20/200")